Clinical trial exclusion criterion:
allergy to lidocaine

Annotated entities:
- Drug: "lidocaine"
- Condition: "allergy"